Age 18-65

The above is a clinical trial inclusion criterion. Annotated with entity spans:
[Person: Age] [Value: 18-65]